What percentage of C. elegans genes reside in operons?

Nearly 15% of the ~20,000 C. elegans genes are contained in operons, multigene clusters controlled by a single promoter.